Clinical trial inclusion criterion:
Users of at least 2 cups of caffeinated coffee per day who are willing to be randomized to any of the interventions.

Annotated entities:
- Multiplier: "at least 2 cups per day"
- Drug: "caffeinated coffee"
- Observation: "willing to be randomized"